Clinical trial inclusion criterion:
HBV DNA < 6 log IU/ml (LLOD)

Annotated entities:
- Measurement: "HBV DNA"
- Value: "< 6 log IU/ml"
- Qualifier: "LLOD"